no previous exposure to etravirine

The above is a clinical trial inclusion criterion. Annotated with entity spans:
[Negation: no] [Temporal: previous] exposure to [Drug: etravirine]